Clinical trial exclusion criterion:
Subject with a spinal cord injury

Annotated entities:
- Condition: "spinal cord injury"